Clinical trial inclusion criteria:
aged between 3 - 36 months
having primary corrective heart surgery

Annotated entities:
- Person: "aged"
- Value: "between 3 - 36 months"
- Qualifier: "primary"
- Procedure: "corrective heart surgery"